Clinical trial exclusion criterion:
Unable to provide informed consent

Annotated entities:
- Informed_consent: "Unable to provide informed consent"